習慣性流產的夫妻其最常見的染色體異常為何？
A. Balanced translocation
B. Inversion
C. Insertion
D. Mosaicism

正確答案：A. Balanced translocation